Clinical trial exclusion criteria:
Age less than 15 or greater than 25 and not participating in the day care center

Annotated entities:
- Person: "Age"
- Value: "less than 15"
- Value: "greater than 25"
- Observation: "participating in the day care center"
- Negation: "not"